Clinical trial inclusion criterion:
Age 18-65 years

Annotated entities:
- Person: "Age"
- Value: "18-65 years"